Clinical trial inclusion criterion:
Aged 25-80 at screening. Subjects older than 80 will be allowed at the discretion of the PI.

Entity relations:
- Has_value("Aged", "25-80")